Clinical trial exclusion criterion:
Acute liver injury (liver aminotransferase concentrations >5 times the upper limit of normal)

Annotated entities:
- Condition: "Acute liver injury"
- Measurement: "liver aminotransferase concentrations"
- Value: ">5 times the upper limit of normal"